Which glands are subject to attack by lymphocytes in Sjogren's syndrome?

Sjögren's syndrome (SjS) is a human autoimmune disease characterized by exocrine dysfunction resulting from chronic autoimmune attack primarily against the lacrimal and/or salivary glands.